Clinical trial inclusion criterion:
With moderate/good ECOG health rating (PS): 0-1 score.

Annotated entities:
- Measurement: "ECOG health rating (PS)"
- Value: "0-1 score"
- Value: "moderate/good"